下列何者不是人類初級（primary）淋巴器官？
A. 胸腺（thymus）
B. 骨髓（bone marrow）
C. 胎兒肝臟（fetal liver）
D. 淋巴結（lymph nodes）

正確答案：D. 淋巴結（lymph nodes）